當患者出現翼狀肩胛骨（winging of the scapula）的症狀時，最常見的原因是由於那一條神經與其支配的肌肉受損所引發？
A. 腋神經（axillary nerve）與三角肌（deltoid muscle）
B. 長胸神經（long thoracic nerve）與前鋸肌（serratus anterior）
C. 肩胛上神經（suprascapular nerve）與棘上肌（supraspinatus）
D. 下肩胛下神經（inferior subscapular nerve）與大圓肌（teres major）

正確答案：B. 長胸神經（long thoracic nerve）與前鋸肌（serratus anterior）